Respecto a la sonda tipo Levin: ¿Cuál de las siguientes afirmaciones es correcta?:
1. Es una sonda rectal.
2. Se utiliza en el tratamiento de las varices esofágicas.
3. Tiene una luz.
4. Es el tipo de sonda de elección para administrar nutrientes.

Respuesta correcta: 3. Tiene una luz.